Lesions in or close to scar tissue (< 1cm)

The above is a clinical trial exclusion criterion. Annotated with entity spans:
[Condition: Lesions] [Qualifier: in or close to scar tissue] ([Value: < 1cm])